On what chromosome is the gene for "SILVER" coat color found for the domestic cat?

Linkage mapping defined a genomic region for SILVER as a 3.3-Mb region, (95.87-99.21 Mb) on chromosome D2 in the domestic cat.